Clinical trial exclusion criterion:
Severe gravidic disease present at inclusion involving life threatening to the mother and/or the child

Annotated entities:
- Condition: "gravidic disease"
- Qualifier: "Severe"
- Qualifier: "life threatening"